What is the effect of resveratrol on mTOR activity?

Resveratrol (RSV) inhibits leucine-stimulated mTORC1 activation by promoting mTOR/DEPTOR.